一名正常產程、足月大的嬰兒，出生後即被發現有吸入性喘鳴（inspiratory stridor）情形，趴睡時可緩解，哭聲正常、無血氧不足及發紺情形，最可能的診斷為何？
A. 雙側聲帶麻痺（bilateral vocal cord paralysis）
B. 喉軟化症（laryngomalacia）
C. 喉蹼（laryngeal web）
D. 聲門下血管瘤（subglottic hemangioma）

正確答案：B. 喉軟化症（laryngomalacia）